Clinical trial inclusion criterion:
Ages=65 years,Not limited to gender.

Annotated entities:
- Person: "Ages"
- Value: "=65 years"